成人的排尿反射中樞大多位在那一節脊椎的位置？
A. 第十胸椎
B. 第一腰椎
C. 第五腰椎
D. 第二薦椎

正確答案：B. 第一腰椎